有關以藥物治療前列腺肥大造成之下泌尿道症狀（lower urinary tract symptoms）之敘述，下列何者錯誤？
A. 抗乙醯膽鹼（anticholinergics）可改善下泌尿道障礙，主要是緩解膀胱刺激性（irritative）或貯藏性
B. 常用的甲型腎上腺素阻斷劑（α-adrenergic blockers）包括：terazosin、doxazosin、tamsulosin 及alfuzosin 等
C. 有時 anticholinergics 會造成排尿更困難，因為它會造成膀胱逼尿肌收縮力變較差
D. α-adrenergic blockers 常見到的副作用為姿態性低血壓及腹瀉

正確答案：D. α-adrenergic blockers 常見到的副作用為姿態性低血壓及腹瀉